Clinical trial exclusion criterion:
secondary osteosarcoma or well-differentiated parosteal osteosarcoma

Annotated entities:
- Condition: "secondary osteosarcoma"
- Condition: "parosteal osteosarcoma"
- Qualifier: "well-differentiated"